Clinical trial exclusion criterion:
Acquired or congenital immunodeficiency;

Entity relations:
- OR("Acquired immunodeficiency", "congenital immunodeficiency")